Patients undergoing an operation that is scheduled to last more than 2 hours

The above is a clinical trial inclusion criterion. Annotated with entity spans:
Patients undergoing an [Procedure: operation] that is [Qualifier: scheduled to last more than 2 hours]